Clinical trial inclusion criterion:
3. Male or female between the ages of 2-99.

Entity relations:
- Has_value("the ages", "between 2-99")
- OR("Male", "female")